Clinical trial inclusion criterion:
Currently receiving treatment with an atypical antipsychotic and continuation on the medication has been recommended

Annotated entities:
- Drug: "atypical antipsychotic"
- Temporal: "Currently"
- Procedure: "treatment"
- Procedure: "continuation on the medication"
- Mood: "recommended"